Which is the RNA sequence of the canonical polyadenylation signal?

A polyadenylation signal (AAUAAA) nearby the 3' end of pre-mRNA is required for poly(A) synthesis.